下列何種細胞激素會促使 NK 和 T 細胞產生 IFN-γ？
A. IL-4
B. IL-6
C. IL-10
D. IL-12

正確答案：D. IL-12